5. Patients with recent (less than 3 years) use chemical drugs or have obvious psychological problems

The above is a clinical trial exclusion criterion. Annotated with entity spans:
5. P[Non-query-able: atients with recent (less than 3 years) use chemical drugs or have obvious psychological problems]